Clinical trial exclusion criteria:
Any other primary DSM-IV diagnosis; DSM-IV criteria for body dysmorphic disorder, bipolar affective disorder, schizophrenia, psychotic disorder, current alcohol/substance abuse.
A previous adequate trial of topiramate
Comorbid major depressive disorder diagnosis which predates OCD diagnosis
Cognitive behavioural therapy or additional psychotherapy in past four months
Allergy or hypersensitivity to topiramate
BMI < 20
History of kidney stones

Annotated entities:
- Qualifier: "DSM-IV"
- Qualifier: "primary"
- Condition: "diagnosis"
- Measurement: "DSM-IV criteria"
- Condition: "body dysmorphic disorder"
- Condition: "bipolar affective disorder"
- Condition: "schizophrenia"
- Condition: "psychotic disorder,"
- Condition: "substance abuse"
- Condition: "alcohol abuse"
- Drug: "topiramate"
- Temporal: "previous"
- Condition: "major depressive disorder"
- Qualifier: "Comorbid"
- Temporal: "predates OCD diagnosis"
- Reference_point: "OCD diagnosis"
- Procedure: "Cognitive behavioural therapy"
- Procedure: "psychotherapy"
- Qualifier: "additional"
- Temporal: "in past four months"
- Condition: "Allergy"
- Condition: "hypersensitivity"
- Drug: "topiramate"
- Measurement: "BMI"
- Value: "< 20"
- Condition: "kidney stones"
- Temporal: "History of"